La regulación por retroalimentación negativa de la hormona tiroidea es como sigue:
1. Altas concentraciones de T3 y T4 libres circulantes que elevan la TRH.
2. Altas concentraciones de T3 y T4 libres circulantes que elevan la TSH.
3. Altas concentraciones de T3 y T4 libres circulantes que disminuyen la TRH.
4. TRH disminuida que eleva la TSH.
5. TSH disminuida que eleva la TRH.

Respuesta correcta: 3. Altas concentraciones de T3 y T4 libres circulantes que disminuyen la TRH.